在同一種（species）動物的不同個體中，同一種免疫球蛋白（如 IgG3）的重鏈恆定區（constant region ）發現有胺基酸的差異，稱為：
A. isotypic variation
B. allotypic variation
C. idiotypic variation
D. random mutation

正確答案：B. allotypic variation